Clinical trial exclusion criterion:
Patients who have been previously treated with epothilone

Entity relations:
- Has_temporal("epothilone", "previously")